Pueden formar parte del receptor del linfocito B en la superficie celular:
1. IgM e IgG.
2. IgD e IgG.
3. IgD e IgM.
4. IgA e IgM.
5. IgG e IgE.

Respuesta correcta: 3. IgD e IgM.